Clinical trial exclusion criterion:
Diabetes mellitus or other systemic illness

Entity relations:
- OR("Diabetes mellitus", "systemic illness")